Donation or loss of greater than one pint of blood within 60 days of entry to the study

The above is a clinical trial exclusion criterion. Annotated with entity spans:
[Non-query-able: Donation or loss of greater than one pint of blood within 60 days of entry to the study]